Clinical trial exclusion criterion:
Presence of serious cardiac or respiratory disease

Entity relations:
- Has_qualifier("cardiac disease", "serious")
- OR("cardiac disease", "respiratory disease")